AST and ALT = 80U/L

The above is a clinical trial inclusion criterion. Annotated with entity spans:
[Measurement: AST] and [Measurement: ALT] [Value: = 80U/L]